一位 42 歲女性因上腹劇烈疼痛已有 2 小時，前來求診，血清生化檢查 amylase 3,564 U/L（正常值 60～180 U/L），lipase 1,500 U/L（正常值＜160 U/L），其他生化檢查無明顯異常。請問應該考慮立即給予病患那些處置？①禁食 ②靜脈輸液 ③靜脈注射 octreotide ④靜脈注射廣效抗生素
A. 只有①②
B. 只有②③
C. 只有②④
D. ①②③④

正確答案：A. 只有①②